Participants are given their written informed consent to participate in the study.

The above is a clinical trial inclusion criterion. Annotated with entity spans:
[Informed_consent: Participants are given their written informed consent to participate in the study].